Clinical trial exclusion criterion:
Painful active, concurrent cervical spine conditions

Annotated entities:
- Condition: "cervical spine conditions"
- Condition: "Painful"